Evidence of ongoing viral infection with HCV, HBV and/or HIV.

The above is a clinical trial exclusion criterion. Annotated with entity spans:
Evidence of [Temporal: ongoing] [Condition: viral infection] with [Condition: HCV], [Condition: HBV] and/or [Condition: HIV].